Clinical trial inclusion criterion:
compensated liver disease.

Annotated entities:
- Qualifier: "compensated"
- Condition: "liver disease"